Clinical trial exclusion criterion:
Alcohol or Drug Dependence within 12 months or Abuse within 3 months (excluding nicotine and caffeine) of baseline visit, as assessed by history and urine drug screen.

Entity relations:
- Has_temporal("Drug Dependence", "within 12 months")
- Has_temporal("Alcohol Dependence", "within 12 months")
- Has_temporal("Drug Abuse", "within 3 months")
- Has_temporal("Alcohol Abuse", "within 3 months")
- Subsumes("Drug Abuse", "nicotine")
- OR("Alcohol Abuse", "Drug Abuse")
- OR("Alcohol Dependence", "Drug Dependence")
- OR("nicotine", "caffeine")